Clinical trial inclusion criterion:
Male or female subjects aged =18 to =65 years

Entity relations:
- Has_value("aged", "=18 to =65 years")
- OR("Male", "female")